26 歲女性病人，間歇性頭痛已有 3 年，尤其在月經來之前更容易發生；頭痛之前常有眼前黑影的現象大約持續 5 至 10 分鐘，頭痛的位置以右眼窩後面最嚴重，有脈搏跳動感，同時有畏光的現象，通 常痛一整天，到隔天睡醒才會好；門診理學檢查無異常之發現。此病人最可能患有：
A. 右眼球後腫瘤
B. 偏頭痛
C. 鼻竇炎
D. 右側內頸動脈狹窄

正確答案：B. 偏頭痛